下列那一項不是造成繼發性副甲狀腺功能亢進的主要原因？
A. 1,25(OH)2 Vit D3製造減少
B. 低血鈣
C. 高血磷
D. 低血鈉

正確答案：D. 低血鈉